Clinical trial inclusion criterion:
The presence of a solid, malignant tumour, excluding lymphoma, that is resistance to standard therapies or for which no standard therapies exist

Annotated entities:
- Condition: "solid, malignant tumour"
- Condition: "lymphoma"
- Negation: "excluding"
- Qualifier: "resistance to standard therapies"
- Qualifier: "for which no standard therapies exist"